一名三週大足月產、出生體重正常的女嬰，被發現有持續性黃疸且大便顏色變淡呈黏土樣而就醫。肝臟切片檢查發現有膽汁鬱積現象，門脈區域可見膽管增生與纖維化，在增生的膽管內有濃稠的膽汁存在。下列敘述何者與此名嬰兒的情況最相關？
A. 這是一種先天代謝性疾病
B. 最可能是 Caroli disease
C. 絕大多數病人可經藥物治療而痊癒
D. 未治療病人在三個月後可變成肝硬化

正確答案：D. 未治療病人在三個月後可變成肝硬化